Clinical trial inclusion criterion:
diagnosis of stroke (>6months);

Annotated entities:
- Condition: "stroke"
- Temporal: ">6months"